下列有關預防顯影劑腎病變的敘述，何者正確？
A. 通常血清肌酸酐於注射顯影劑後24～48小時開始上升，有高於1%病人需接受透析治療
B. 以生理鹽水預防顯影劑腎病變，可於施打顯影劑後開始給與，持續6～24小時
C. 統合分析顯示N-acetylcysteine預防顯影劑腎病變的效果佳且副作用低，建議臨床上常規使用
D. 其致病機轉包括腎臟outer medulla缺氧、腎小管細胞自由基傷害及暫時性腎小管阻塞等因素

正確答案：D. 其致病機轉包括腎臟outer medulla缺氧、腎小管細胞自由基傷害及暫時性腎小管阻塞等因素